下列何種疾病常需要外科手術治療？
A. 擴張型心肌症（dilated cardiomyopathy）
B. 窄縮型心肌症（restrictive cardiomyopathy）
C. 急性心肌炎（acute myocarditis）
D. 縮窄性心包膜炎（constrictive pericarditis）

正確答案：D. 縮窄性心包膜炎（constrictive pericarditis）